Clinical trial exclusion criterion:
Has received or is planned to receive toremifene and/or fusidic acid via IV administration within 24 hours before or within 24 hours after administration of study treatment.

Annotated entities:
- Drug: "toremifene"
- Mood: "planned to"
- Drug: "fusidic acid"
- Qualifier: "IV administration"
- Temporal: "within 24 hours before administration of study treatment"
- Temporal: "within 24 hours after administration of study treatment"
- Reference_point: "administration of study treatment"
- Reference_point: "administration of study treatment"